What is Quorum Sensing in bacteria?

In many pathogenic microorganisms, communication systems, collectively termed quorum sensing (QS), have been observed